下列有關以激素治療因手術切除腦下垂體腫瘤（pituitary adenoma）所導致前葉功能全面性降低之敘述，何者正確？
A. 只補充雄性素（androgen）即可恢復病患精子製造能力
B. 不需要補充甲狀腺素（thyroid hormone）
C. 需補充抗利尿激素（ADH）以防止尿崩症
D. 當處於壓力（stress）狀況時，需補充額外之腎上腺皮質素（cortisol）

正確答案：D. 當處於壓力（stress）狀況時，需補充額外之腎上腺皮質素（cortisol）